Patients with caudal equine syndrome.

The above is a clinical trial exclusion criterion. Annotated with entity spans:
Patients with [Condition: caudal equine syndrome].